What effect does Methylsulfonylmethane (MSM) have on inflammation?

Methylsulfonylmethane (MSM) exerts anti-inflammatory activity in the body